4. Ulcers that extend through the epidermis but not through the muscle, tendon, or bone (Stage II or III ulcers as defined by the IAET).

The above is a clinical trial inclusion criterion. Annotated with entity spans:
[Parsing_Error: 4.] [Condition: Ulcers] that [Qualifier: extend through the epidermis] but [Negation: not] through the muscle, tendon, or bone ([Value: Stage II or III] [Condition: ulcers] as defined by the [Measurement: IAET]).